下列敘述，何者錯誤？
A. 大部分的敗血性休克（septic shock）病人有低血壓及血管收縮（vasoconstriction）的現象，少部分則有動脈血管舒張（arterial vasodilatation）的現象
B. 敗血性休克病人有血管舒張之現象時，其心輸出量（cardiac output）高於正常人
C. 敗血性休克時，微血管細胞膜通透性會增加，需要等於體重 10%的晶體輸液（crystalloid fluid）以恢復中心靜脈壓（central venous pressure）
D. 敗血性休克病人接受足夠的輸液後，如果仍然是低血壓，可以給予 dopamine 或 norepinephrine

正確答案：A. 大部分的敗血性休克（septic shock）病人有低血壓及血管收縮（vasoconstriction）的現象，少部分則有動脈血管舒張（arterial vasodilatation）的現象